Clinical trial exclusion criterion:
History of significant neurologic or psychiatric disorders including dementia or seizures

Entity relations:
- Subsumes("neurologic disorders", "dementia")
- OR("neurologic disorders", "psychiatric disorders")
- OR("dementia", "seizures")